How many different miRNAs can be upregulated by LB-100?

LB-100 has been reported to upregulate one miRNA, namely miR-181b-1.